Clinical trial exclusion criterion:
Patients using any herbal psychoactive treatments, e.g. St John's Wort, Valerian, Kava Kava, L-tryptophan.

Entity relations:
- Subsumes("herbal psychoactive treatments", "St John's Wort")
- OR("St John's Wort", "Valerian", "Kava Kava", "L-tryptophan")